下列何者是中華肝吸蟲（Clonorchis sinensis）的確認診斷？
A. 有生食淡水魚的習慣
B. 周邊血的嗜酸性白血球增多
C. 有上腹疼痛、肝腫大、黃疸的現象
D. 自糞便中檢出蟲卵

正確答案：D. 自糞便中檢出蟲卵